Clinical trial exclusion criterion:
History of vitrectomy surgery, submacular surgery, or other surgical intervention for AMD

Annotated entities:
- Procedure: "vitrectomy surgery"
- Procedure: "submacular surgery"
- Procedure: "surgical intervention"
- Qualifier: "other"
- Condition: "AMD"